Clinical trial exclusion criterion:
5. Transmural myocardial infarction within the previous seven days and CK has not returned to normal;

Annotated entities:
- Procedure: "Transmural myocardial infarction"
- Temporal: "within the previous seven days"
- Measurement: "CK"
- Negation: "has not returned"
- Value: "normal"